Clinical trial exclusion criterion:
Post-traumatic or post surgery of lower extremity

Entity relations:
- OR("Post-traumatic of lower extremity", "post surgery of lower extremity")